Women (18-75 years) with suspected UTI

The above is a clinical trial inclusion criterion. Annotated with entity spans:
[Person: Women] ([Value: 18-75] [Person: years]) with [Qualifier: suspected] [Condition: UTI]